一位 14 歲少年，每日打籃球 2 小時以上，近日感覺右膝疼痛，於診間發現他的右膝前脛骨結節有隆起及觸痛，他最可能罹患何種疾病？
A. Legg-Calvé-Perthes disease
B. Osgood-Schlatter disease
C. Freiberg's disease
D. Panner's disease

正確答案：B. Osgood-Schlatter disease